Clinical trial exclusion criterion:
Clinically significant abnormalities of glucose metabolism

Entity relations:
- Has_qualifier("abnormalities of glucose metabolism", "Clinically significant")